history of pyelonephritis

The above is a clinical trial exclusion criterion. Annotated with entity spans:
history of [Condition: pyelonephritis]